有關電擊傷（electric injury）及閃電擊傷（lightning injury）之描述，下列何者正確？
A. 閃電擊傷因伏特電壓極高，死亡率亦較高
B. 逆向檢傷（reverse triage）是閃電擊傷造成大量傷患現場處理的原則
C. 靜脈輸液補充之原則對於電擊傷及閃電擊傷之病患是相同的
D. 高伏特閃電休克常造成冠狀動脈痙攣（coronary artery spasm）產生心室顫動（VF）而死亡

正確答案：B. 逆向檢傷（reverse triage）是閃電擊傷造成大量傷患現場處理的原則